Clinical trial exclusion criterion:
History of treatment for molar pregnancy like prior evacuation or chemotherapy

Entity relations:
- AND("treatment", "molar pregnancy")
- Subsumes("treatment", "evacuation")
- OR("evacuation", "chemotherapy")